楊小姐在與長官爭吵後，突然講不出話來，一個多月來在許多科別診治，並未發現有任何器官上的問題。今日來精神科就診，精神科醫師診斷楊小姐的講不出話並不是刻意裝出來，不過其症狀不是神經學或是其他生理疾病可以解釋。楊小姐最可能的診斷為何？
A. 詐病（malingering）
B. 偽病（factitious disorder）
C. 解離症（dissociative disorder）
D. 轉化症（conversion disorder）

正確答案：D. 轉化症（conversion disorder）